Clinical trial inclusion criterion:
Person is walking not slower than 3km/h (~0.8m/s) (based on 10m walk test conducted during recruiting).

Entity relations:
- Has_multiplier("walking", "not slower than 3km/h")